Clinical trial exclusion criterion:
Breast-feeding women or fertile women not agreeing to use an effective method of contraception

Annotated entities:
- Condition: "Breast-feeding"
- Person: "women"
- Condition: "fertile"
- Person: "women"
- Observation: "agreeing to use an effective method of contraception"
- Negation: "not"